4. Active brain metastases. Patients with treated brain metastases are eligible, if (1) radiation therapy was completed at least 2 weeks prior to study entry; (2) follow-up scan shows no disease progression; and (3) patient does not require steroids.

The above is a clinical trial exclusion criterion. Annotated with entity spans:
4. [Temporal: Active] [Condition: brain metastases]. Patients with [Procedure: treated] [Condition: brain metastases] [Negation: are eligible], if (1) [Procedure: radiation therapy] was completed [Temporal: at least 2 weeks prior to study entry]; (2) [Procedure: follow-up scan] shows [Negation: no] [Condition: disease progression]; and (3) patient does [Negation: not] [Mood: require] [Drug: steroids].